Clinical trial inclusion criterion:
Ability and willingness of participant or a legally authorized representative (see protocol for more information) to provide informed consent

Annotated entities:
- Post-eligibility: "Ability and willingness of participant or a legally authorized representative (see protocol for more information) to provide informed consent"